La piruvato carboxilasa:
1. Cataliza una reacción gluconeogénica.
2. Sintetiza acetil-CoA partir de piruvato.
3. Cataliza una reacción del ciclo de Krebs.
4. Sintetiza citrato a partir de piruvato.

Respuesta correcta: 1. Cataliza una reacción gluconeogénica.